Clinical trial exclusion criterion:
Metabolic disease contraindicating use of the ketogenic diet e.g. pyruvate carboxylase deficiency, MCAD from previous medical investigation and screening at baseline.

Entity relations:
- AND("Metabolic disease", "contraindicating")
- AND("contraindicating", "ketogenic diet")
- AND("Metabolic disease", "pyruvate carboxylase deficiency,")
- OR("pyruvate carboxylase deficiency,", "MCAD")